Clinical trial exclusion criterion:
impossibility to obtain a signed consent form.

Annotated entities:
- Observation: "signed consent form"
- Condition: "impossibility to obtain"